critical limb ischemia (Rutherford class 4-6)

The above is a clinical trial inclusion criterion. Annotated with entity spans:
[Qualifier: critical] [Condition: limb ischemia] ([Measurement: Rutherford class] [Value: 4-6])